Clinical trial inclusion criterion:
3. Individuals living with other family members

Annotated entities:
- Parsing_Error: "3."
- Non-query-able: "Individuals living with other family members"